頂骨（Parietal bone）、額骨（frontal bone）、顳骨（temporal bone）及顴骨（zygomatic bone）之交界處稱為：
A. 前囟點（Bregma）
B. 人字點（Lambda）
C. 枕外隆凸點（Inion）
D. 翼點（Pterion）

正確答案：D. 翼點（Pterion）